Preoperative obstructive sleep apnea (previously diagnosed as obstructive sleep apnea, or a STOP-Bang score >= 3);

The above is a clinical trial exclusion criterion. Annotated with entity spans:
[Temporal: Preoperative] [Condition: obstructive sleep apnea] (previously diagnosed as [Condition: obstructive sleep apnea], or a [Measurement: STOP-Bang score] [Value: >= 3]);